上皮細胞的表面常以下列何種特化構造增加表面積？
A. 微絨毛（microvilli）
B. 基底膜（basement membrane）
C. 接合複體（junctional complex）
D. 纖毛（cilia）

正確答案：A. 微絨毛（microvilli）